Clinical trial exclusion criterion:
Preoperative Hemoglobin <U+2266>11 g/dl

Entity relations:
- Has_value("Hemoglobin", "<U+2266>11 g/dl")
- Has_temporal("Hemoglobin", "Preoperative")